關於胃黏膜分泌胃酸和內在因子（intrinsic factor）的敘述，下列何者錯誤？
A. 慢性胃炎會引起胃黏膜逐漸萎縮，並導致胃酸分泌減少
B. 無酸症（achlorhydria）病人經各種刺激後，胃液的 pH 值仍無法降至 pH6.5 以下
C. 內在因子是胃黏膜的主細胞（chief cell）所分泌的醣蛋白（glycoprotein）；胃酸則由壁細胞（parietal cell）所分泌
D. 缺乏內在因子會使維生素B12B 吸收不良，進而導致惡性貧血（pernicious anemia）

正確答案：C. 內在因子是胃黏膜的主細胞（chief cell）所分泌的醣蛋白（glycoprotein）；胃酸則由壁細胞（parietal cell）所分泌